Newborns weighing 1.5kg or more at birth

The above is a clinical trial inclusion criterion. Annotated with entity spans:
[Person: Newborns] [Measurement: weighing] [Value: 1.5kg or more] [Temporal: at birth]